Clinical trial inclusion criterion:
Developed HBeAg seroconversion (HBeAg negative and ant-HBe negative) with undetectable HBV DNA by PCR based assay on NA treatment.

Annotated entities:
- Measurement: "HBeAg"
- Value: "seroconversion"
- Measurement: "HBeAg"
- Measurement: "ant-HBe"
- Value: "negative"
- Value: "negative"
- Value: "undetectable"
- Measurement: "HBV DNA"
- Procedure: "PCR based assay"
- Drug: "NA"
- Procedure: "treatment"